Clinical trial inclusion criterion:
Patient fulfils DSM-IV and NINCDS-ADRA criteria for probable Alzheimers disease

Annotated entities:
- Measurement: "DSM-IV criteria"
- Measurement: "NINCDS-ADRA criteria"
- Condition: "Alzheimers disease"
- Mood: "probable"
- Value: "fulfils"